Clinical trial inclusion criterion:
Provided written consent for participation in the trial prior to any study-specific procedures or requirements.

Annotated entities:
- Observation: "written consent for participation in the trial"
- Temporal: "prior to any study-specific procedures or requirements"
- Reference_point: "any study-specific procedures or requirements"